Clinical trial inclusion criterion:
R0, R1 resection

Entity relations:
- OR("R0 resection", "R1 resection")